What is ASTRAL Score?

ASTRAL Score is used to predict prognosis of stroke patients.